Clinical trial exclusion criterion:
• Diabetes duration >12 years

Entity relations:
- Has_temporal("Diabetes", ">12 years")